下列何種狀況最可能導致左右兩眼的外側視野均有缺失？
A. 視神經交叉（optic chiasm）處受損
B. 左側的視神經（optic nerve）受損
C. 右側的視神經（optic nerve）受損
D. 右側的視神經束（optic tract）受損

正確答案：A. 視神經交叉（optic chiasm）處受損